下列有關肺部發生纖維化（fibrosis）後肺功能變化之敘述，何者錯誤？
A. 肺活量（vital capacity）減少
B. 功能性肺餘容量（functional residual capacity）增加
C. 運動時，常呈現淺快呼吸型態（rapid shallow breathing）
D. 第一秒用力呼氣容積（FEV1）通常會減少

正確答案：B. 功能性肺餘容量（functional residual capacity）增加